What is the the Menzerath-Altmann law?

Menzerath-Altmann law is a statistical law that defines the dependency between the mean size of the whole and the number of parts in quantitative linguistics.